一位 24 歲女性，乳房摸到有腫塊，宜先採用下列何種檢查？
A. 切片手術
B. 乳房超音波
C. 乳房熱像學
D. 乳房 X 光攝影

正確答案：B. 乳房超音波